Clinical trial exclusion criterion:
Women of childbearing potential who do not practice a medically accepted highly effective contraception during the trial and one month beyond

Annotated entities:
- Pregnancy_considerations: "Women of childbearing potential who do not practice a medically accepted highly effective contraception during the trial and one month beyond"